Presence of kidney comorbidities

The above is a clinical trial exclusion criterion. Annotated with entity spans:
Presence of [Condition: kidney comorbidities]